ONB within 1 year post-surgery.

The above is a clinical trial inclusion criterion. Annotated with entity spans:
[Condition: ONB] [Temporal: within 1 year post-surgery].